2. Patients undergoing primary or subsequent deceased-donor or living donor kidney transplantation.

The above is a clinical trial inclusion criterion. Annotated with entity spans:
2. Patients undergoing [Multiplier: primary] or [Multiplier: subsequent] [Procedure: deceased-donor] or [Procedure: living donor kidney transplantation].